En relación con el proceso de formación de impresiones, ¿a qué hace referencia el fenómeno de la Defensa Perceptiva?
1. Bajo umbral para percibir estímulos amenazadores.
2. Bajo umbral de reconocimiento ante estímulos que satisfacen nuestras necesidades.
3. Alto umbral para percibir estímulos amenazadores.
4. Alto umbral de reconocimiento ante estímulos positivos.
5. Bajo umbral para percibir tanto estímulos negativos como positivos.

Respuesta correcta: 3. Alto umbral para percibir estímulos amenazadores.